Which is the most mutated gene in dilated cardiomyopathy (DCM)?

The most mutated gene in dilated cardiomyopathy (DCM) is the lamin A/C gene. Mutations in this gene are responsible for the most common form of DCM and result in a recessive form of cardiac hypertrophy.  A compound heterozygous one amino-acid insertion/nonsense mutation in the plectin gene causes dilatedCardiac b-myosin heavy chain gene (LMNA) to be mutated in 25% of patients with DCM.